prostatic carcinoma

The above is a clinical trial exclusion criterion. Annotated with entity spans:
[Condition: prostatic carcinoma]